Clinical trial exclusion criterion:
Severe concomitant disease with life expectancy below 12 months;

Entity relations:
- Has_value("life expectancy", "below 12 months")
- Has_temporal("disease", "concomitant")
- Has_qualifier("disease", "Severe")
- Has_context("disease", "life expectancy")